Clinical trial exclusion criterion:
Known hypersensitivity to Brilliant Blue FCF (E133)

Annotated entities:
- Condition: "hypersensitivity"
- Drug: "Brilliant Blue FCF (E133)"
- Drug: "Brilliant Blue FCF (E133)"